Clinical trial inclusion criterion:
definite unilateral vestibulopathy

Entity relations:
- Has_qualifier("vestibulopathy", "unilateral")